Clinical trial exclusion criterion:
History of corticosteroid injection to affected shoulder within the last 3 months

Entity relations:
- Has_temporal("corticosteroid injection", "last 3 months")
- Has_qualifier("corticosteroid injection", "shoulder")
- Has_temporal("corticosteroid injection", "History of")